Clinical trial exclusion criterion:
Hepatic dysfunction with increased bleeding risk

Annotated entities:
- Condition: "Hepatic dysfunction"
- Observation: "bleeding risk"
- Qualifier: "increased"